Subjects that are age 18-90

The above is a clinical trial inclusion criterion. Annotated with entity spans:
Subjects that are [Person: age] [Value: 18-90]